Zollinger-Ellison Syndrome 之特徵為何？
A. 產生胰臟炎
B. 產生膽結石
C. 血清素（serotonin）的分泌增加
D. 胃泌素（gastrin）的分泌增加

正確答案：D. 胃泌素（gastrin）的分泌增加